Clinical trial inclusion criteria:
Aged =18 years
Clinical diagnosis of acute coronary syndrome
In the opinion of the attending clinician requires dual anti-platelet therapy with aspirin and a P2Y12 receptor antagonist
Resident in Scotland with a Community Health Index (CHI) number
The attending clinician has equipoise regarding the duration of therapy
Provision of informed consent

Annotated entities:
- Person: "Aged"
- Value: "=18 years"
- Condition: "acute coronary syndrome"
- Procedure: "dual anti-platelet therapy"
- Drug: "aspirin"
- Drug: "P2Y12 receptor antagonist"
- Mood: "requires"
- Person: "Resident"
- Visit: "Scotland"
- Non-representable: "Community Health Index (CHI) number"
- Non-representable: "The attending clinician has equipoise regarding the duration of therapy"
- Informed_consent: "Provision of informed consent"